Subject has indeterminate, ulcerative, antibiotic-associated colitis.

The above is a clinical trial exclusion criterion. Annotated with entity spans:
Subject has [Observation: indeterminate], [Observation: ulcerative], [Observation: antibiotic-associated] [Condition: colitis].